Clinical trial exclusion criterion:
Rheumatic conditions (Rheumatoid arthritis, lupus, and any other autoimmune disease the -PI deems them to be ineligible for)

Entity relations:
- Subsumes("Rheumatic conditions", "Rheumatoid arthritis")
- OR("Rheumatoid arthritis", "lupus", "autoimmune disease")